Clinical trial exclusion criterion:
Ductal carcinoma in situ (DCIS; stage 0 cancer),

Annotated entities:
- Condition: "Ductal carcinoma in situ"
- Condition: "DCIS"
- Measurement: "stage"
- Condition: "cancer"
- Value: "0"